Como el resultado de un ictus reciente, una persona ha sufrido una hemiplejia sensorofuncional. Para favorecer la máxima estimulación del lado afectado, la enfermera deberá:
1. Colocarle objetos en el lado no afectado para estimular la capacidad funcional.
2. Abordar al paciente desde el lado no afectado.
3. Disminuir la estimulación sensorial para evitar la sensación de frustración.
4. Colocar objetos en el lado afectado para estimular el uso de las extremidades paréticas.

Respuesta correcta: 4. Colocar objetos en el lado afectado para estimular el uso de las extremidades paréticas.